Which disease can be treated with Delamanid?

Delamanid is used in patients with multidrug-resistant tuberculosis.